Clinical trial inclusion criteria:
scheduled for Nuss procedure for pectus excavatum correction
at least 13 years old at the time of the procedure

Annotated entities:
- Procedure: "Nuss procedure"
- Mood: "scheduled"
- Condition: "pectus excavatum"
- Value: "at least 13 years"
- Person: "old"
- Temporal: "at the time of the procedure"